Clinical trial inclusion criterion:
Patients with (highly) active RRMS disease course indicated to receive alemtuzumab according to the following conditions (at least 1 out of 3 conditions has to be fulfilled): 1. =2 MS relapses within 24 months, 2. clinical (=1 relapse) or MRI (new gadolinium enhancing lesions) disease activity under therapy with other diseasemodifying therapies, 3. severe relapse with high disease activity (=9 T2 hyperintense Lesions and =1 gadolinium enhancing lesion) on MRI.

Annotated entities:
- Condition: "RRMS"
- Qualifier: "active"
- Drug: "alemtuzumab"
- Condition: "MS relapses"
- Multiplier: "=2"
- Temporal: "within 24 months,"
- Condition: "relapse"
- Multiplier: "=1"
- Procedure: "MRI"
- Condition: "relapse"
- Qualifier: "severe"
- Condition: "Lesions"
- Qualifier: "T2 hyperintense"
- Multiplier: "=9"
- Condition: "lesion"
- Qualifier: "gadolinium enhancing"
- Multiplier: "=1"
- Procedure: "MRI"
- Condition: "lesions"
- Qualifier: "gadolinium enhancing"
- Qualifier: "new"